一位 35 歲的女性病患，身高 155 公分，體重 85 公斤，來到門診主訴頭痛和視力模糊已有好幾個月。除眼底檢查發現有兩側視乳突水腫（papilledema）外，神經學檢查正常。腦部磁振造影檢查也無特殊發現。下列何者為最可能的診斷？
A. 腦膜炎
B. 原發性顱內高壓
C. 青光眼
D. 偏頭痛

正確答案：B. 原發性顱內高壓